一位 32 歲男性主訴胸痛持續一週，該胸痛在吸氣時加劇，患者仍可正常活動，血壓 130/80 mmHg，心跳每分鐘 90 次，聽診上有收縮期與舒張期之額外心音（extra heart sounds），但無明顯雜音，心電圖在肢導與胸前導皆呈現 ST 波上昇，心臟酵素正常。最有可能之診斷為何？
A. 心肌梗塞（myocardial infarction）
B. 不穩定型心絞痛（unstable angina）
C. 主動脈剝離（aortic dissection）
D. 心包膜炎（pericarditis）

正確答案：D. 心包膜炎（pericarditis）